人類感染恙蟲病（scrub typhus）主要是經由下列何者之叮咬而感染？
A. 感染性成蜱（tick）
B. 感染性幼蜱（tick）
C. 感染性成蟎（mite）
D. 感染性幼蟎（mite）

正確答案：D. 感染性幼蟎（mite）